Enrollment time more than 1 hr since arrival to emergency room or PICU

The above is a clinical trial exclusion criterion. Annotated with entity spans:
[Observation: Enrollment] time [Temporal: more than 1 hr since arrival to emergency room or PICU]